Clinical trial inclusion criterion:
Has a life expectancy of >3 months

Entity relations:
- Has_value("life expectancy", ">3 months")